下列何者可使枕寰關節（atlanto-occipital joint）彎曲？
A. 頭長肌（longus capitis）
B. 頭後大直肌（rectus capitis posterior major）
C. 頭上斜肌（obliquus capitis superior）
D. 頭夾肌（splenius capitis）

正確答案：A. 頭長肌（longus capitis）